Clinical trial exclusion criterion:
Evidence of HCC

Annotated entities:
- Condition: "HCC"
- Mood: "Evidence"